Clinical trial exclusion criterion:
Gallbladder's wall >3mm, atrophied gallbladder,gallstone obstruct the Hartmann's pouch.

Annotated entities:
- Measurement: "Gallbladder's wall"
- Value: ">3mm"
- Condition: "atrophied gallbladder"
- Condition: "gallstone obstruct"
- Qualifier: "Hartmann's pouch"